於手術中監測病人的潮氣容積末二氧化碳（EtCO2）時，在下列那一種情況會上升？
A. 發生空氣栓塞（Air embolism）
B. 惡性高熱（Malignant hyperthermia）
C. 心輸出量減少
D. 血壓降低

正確答案：B. 惡性高熱（Malignant hyperthermia）